下列有關各種病媒（vector）及其傳播的感染症之關係，何者錯誤？
A. 白線斑蚊（Aedes albopictus）傳播日本腦炎（Japanese encephalitis）
B. 埃及斑蚊（Aedes aegypti）傳播黃熱病（yellow fever）
C. 熱帶家蚊（Culex quinquefasciatus）傳播血絲蟲症（filariasis）
D. 蚋（black fly）傳播河川盲（river blindness）

正確答案：A. 白線斑蚊（Aedes albopictus）傳播日本腦炎（Japanese encephalitis）